發展淋病（gonorrhea）疫苗最主要的困難為何？
A. 淋病球菌無法於體外培養
B. 淋病球菌體表成分不具抗原性
C. 淋病球菌無法在人體產生保護性抗體
D. 淋病球菌體表抗原性極易改變

正確答案：D. 淋病球菌體表抗原性極易改變